Taking Kaletra containing regimen with suppressed viral load.

The above is a clinical trial inclusion criterion. Annotated with entity spans:
Taking [Drug: Kaletra] containing [Procedure: regimen] with [Value: suppressed] [Measurement: viral load].